Subject in an exclusion period from another study,

The above is a clinical trial exclusion criterion. Annotated with entity spans:
[Non-query-able: Subject in an exclusion period from another study],